Clinical trial exclusion criterion:
Uncontrolled medical problems including pulmonary, cardiovascular or orthopedic disease,

Entity relations:
- Has_qualifier("medical problems", "Uncontrolled")
- Subsumes("medical problems", "pulmonary disease")
- OR("pulmonary disease", "orthopedic disease", "cardiovascular disease")